The inability to provide informed consent.

The above is a clinical trial inclusion criterion. Annotated with entity spans:
[Non-query-able: The inability to provide informed consent.]